Age 18 to 80 years old

The above is a clinical trial inclusion criterion. Annotated with entity spans:
[Person: Age] [Value: 18 to 80 years] old